Clinical trial inclusion criterion:
Symptomatic GSV or SSV vein reflux > 0.5 seconds on colour Duplex

Entity relations:
- Has_qualifier("GSV vein reflux", "> 0.5 seconds")
- AND("colour Duplex", "GSV vein reflux")
- OR("GSV vein reflux", "SSV vein reflux")